2. Pulmonary venous hypertension (measured as pulmonary capillary wedge pressure (PCWP) ≤15 mmHg. If PCWP is not available, then mean left atrial pressure or left ventricular end-diastolic pressure ≤15 mmHg in the absence of left atrial obstruction. and

The above is a clinical trial inclusion criterion. Annotated with entity spans:
[Parsing_Error: 2.] [Condition: Pulmonary venous hypertension] (measured as [Measurement: pulmonary capillary wedge pressure (PCWP)] [Value: ≤15 mmHg]. If PCWP is not available, then [Condition: mean left atrial pressure] or [Condition: left ventricular end-diastolic pressure] [Value: ≤15 mmHg] in the [Negation: absence] of [Condition: left atrial obstruction]. and